En el tratamiento con progestágenos, se producen un número importante de efectos adversos. De los que se enuncian a continuación, el más grave es:
1. Insuficiencia hepática.
2. Enfermedad tromboembólica.
3. Insuficiencia respiratoria.
4. Depresión.
5. Insuficiencia cardíaca.

Respuesta correcta: 2. Enfermedad tromboembólica.